Clinical trial exclusion criteria:
Type 1 diabetes
uncontrolled diabetes mellitus type 2 with fasting glucose > 13.3 mmol/l confirmed on a second day
known or suspected hypersensitivity to empagliflozin, glimepiride, or any excipients; and / or known or suspected hypersensitivity to sulfonylureas, sulfonamides or SGLT2 inhibitors in general
history of multiple severe hypoglycemic episodes within the last two years
use of Insulin, SGLT2-inhibitor, sulfonylurea derivate or a glinide within past 3 months
clinical significant macular edema in both eyes and indication for intravitreal anti-VEGF treatment for both eyes at screening or baseline visit. Eyes with a small amount of intraretinal or subretinal fluid (seen in OCT) but no need for intravitreal treatment as judged by the investigator (according to current practice patterns) may be included. Eyes with a history of intravitreal treatment of macular edema which do not need ongoing intravitreal treatment at the time of screening may be included.
eye diseases or pathologies that prevent clear ophthalmoscopy and evaluation of study parameters, thus not allowing study participation according to the investigator´s judgment, such as (but not only) vitreous hemorrhage, mature cataract, macular pathologies other than diabetic maculopathy
history of ketoacidosis or metabolic acidosis
use of loop diuretics
history of > 1 urogenital infection/year
any history of stroke, transient ischemic attack (TIA), instable angina pectoris or myocardial infarction within last 3 months prior to baseline visit
congestive heart failure New York Heart Association (NYHA) III and IV
severe valvular or left ventricular outflow obstruction disease needing intervention;
atrial fibrillation/flutter with a mean ventricular response rate at rest >100 beats per minute
chronic lower urinary tract infections (but not simple asymptomatic bacteriuria)
eGFR < 60 ml/min/1,73 m2 (MDRD-formula, confirmed on a second day)
chronic diarrhea, any clinical signs of volume depletion or a hematocrit > 48 % (women) and > 53 % (men)
elevated risk for volume depletion, e.g. history of severe volume depletion that required medical therapy
chronic liver disease (including known active hepatitis) and/or screening alanine transaminase (ALT) or aspartate transaminase (AST) > 3 x upper limit of normal (ULN) (confirmed on a second day)
Subjects with known seropositivity to human immunodeficiency virus.
acute illness at screening or randomization according to judgement by the investigator or patient
drug or alcohol abuse
psychosomatic or psychiatric diseases requiring hospitalization during the last 12 months
clinical evidence of current malignancy with exception of basal cell or squamous cell carcinoma of the skin, and cervical intraepithelial neoplasia (5 years prior to randomization)
any medical or surgical intervention planned for the next 13 months after randomization not allowing study participation according to the investigator´s judgment
current participation in any other clinical trial or participation in another clinical trial within 30 days before screening

Annotated entities:
- Condition: "Type 1 diabetes"
- Condition: "diabetes mellitus type 2"
- Qualifier: "uncontrolled"
- Measurement: "fasting glucose"
- Value: "> 13.3 mmol/l"
- Condition: "hypersensitivity"
- Drug: "empagliflozin"
- Drug: "glimepiride"
- Condition: "hypersensitivity"
- Drug: "sulfonylureas"
- Drug: "sulfonamides"
- Drug: "SGLT2 inhibitors"
- Condition: "hypoglycemic episodes"
- Qualifier: "severe"
- Multiplier: "multiple"
- Temporal: "last two years"
- Drug: "Insulin"
- Drug: "SGLT2-inhibitor"
- Drug: "sulfonylurea derivate"
- Drug: "glinide"
- Temporal: "past 3 months"
- Condition: "macular edema"
- Qualifier: "both eyes"
- Procedure: "intravitreal anti-VEGF treatment"
- Qualifier: "both eyes"
- Non-query-able: "Eyes with a small amount of intraretinal or subretinal fluid (seen in OCT) but no need for intravitreal treatment as judged by the investigator (according to current practice patterns) may be included. Eyes with a history of intravitreal treatment of macular edema which do not need ongoing intravitreal treatment at the time of screening may be included"
- Negation: "prevent"
- Procedure: "ophthalmoscopy"
- Condition: "vitreous hemorrhage"
- Condition: "mature cataract"
- Condition: "macular pathologies"
- Negation: "other"
- Condition: "diabetic maculopathy"
- Condition: "ketoacidosis"
- Condition: "metabolic acidosis"
- Drug: "loop diuretics"
- Condition: "urogenital infection"
- Multiplier: "> 1 /year"
- Condition: "stroke"
- Condition: "transient ischemic attack"
- Condition: "TIA"
- Condition: "angina pectoris"
- Qualifier: "instable"
- Condition: "myocardial infarction"
- Temporal: "last 3 months prior to baseline visit"
- Reference_point: "baseline visit"
- Condition: "congestive heart failure"
- Measurement: "New York Heart Association"
- Measurement: "NYHA"
- Value: "III and IV"
- Condition: "left ventricular outflow obstruction"
- Condition: "valvular disease"
- Qualifier: "severe"
- Procedure: "intervention"
- Condition: "atrial fibrillation"
- Condition: "atrial flutter"
- Measurement: "mean ventricular response rate"
- Qualifier: "at rest"
- Value: ">100 beats per minute"
- Condition: "lower urinary tract infections"
- Qualifier: "chronic"
- Negation: "not"
- Condition: "asymptomatic bacteriuria"
- Measurement: "eGFR"
- Value: "< 60 ml/min/1,73 m2"
- Condition: "chronic diarrhea"
- Condition: "volume depletion"
- Measurement: "hematocrit"
- Value: "> 48 %"
- Person: "women"
- Value: "> 53 %"
- Person: "men"
- Measurement: "hematocrit"
- Observation: "risk for volume depletion,"
- Qualifier: "elevated"
- Condition: "chronic liver disease"
- Condition: "active hepatitis"
- Measurement: "alanine transaminase"
- Measurement: "ALT"
- Measurement: "aspartate transaminase"
- Measurement: "AST"
- Value: "> 3 x upper limit of normal"
- Measurement: "human immunodeficiency virus"
- Value: "seropositivity"
- Non-query-able: "acute illness at screening or randomization according to judgement by the investigator or patient"
- Condition: "alcohol abuse"
- Condition: "drug abuse"
- Condition: "psychiatric diseases"
- Condition: "psychosomatic diseases"
- Visit: "hospitalization"
- Temporal: "last 12 months"
- Condition: "malignancy"
- Negation: "exception"
- Condition: "basal cell carcinoma of the skin"
- Condition: "squamous cell carcinoma of the skin"
- Condition: "cervical intraepithelial neoplasia"
- Temporal: "5 years prior to randomization"
- Reference_point: "randomization"
- Non-query-able: "ny medical or surgical intervention planned for the next 13 months after randomization not allowing study participation according to the investigator´s judgment"
- Competing_trial: "current participation in any other clinical trial or participation in another clinical trial within 30 days before screening"